Placenda previa and/or accreta

The above is a clinical trial exclusion criterion. Annotated with entity spans:
[Condition: Placenda previa] and/or [Condition: accreta]